Male and/or female healthy volunteers, age 18 to 55 years. Females must be of non-childbearing potential.

The above is a clinical trial inclusion criterion. Annotated with entity spans:
[Person: Male] and/or [Person: female] [Condition: healthy] volunteers, [Person: age] [Value: 18 to 55 years]. [Person: Females] must be of [Negation: non]-[Condition: childbearing potential].